Señale la respuesta INCORRECTA en relación a las medidas de prevención primaria del cáncer cutáneo:
1. Evitar la exposición solar entre las 12 y 15 horas.
2. Aplicación de cremas solares con índice de protección solar alto, 15 minutos antes de la exposición.
3. Utilizar la fotoprotección para aumentar el tiempo de exposición al sol.
4. Utilizar gafas de sol, gorros y ropa adecuada, así como toldos y sombrillas.
5. No exponer a los bebés al sol ni a aquellas personas que estén en tratamiento con inmunosupresores.

Respuesta correcta: 3. Utilizar la fotoprotección para aumentar el tiempo de exposición al sol.